What is Morton's Neuroma?

Morton's neuroma (MN) is a neuralgia involving the common plantar digital nerves of the metatarsal region.